Clinical trial inclusion criterion:
Infertile women with eugonadotrophic anovulation/oligoovulation.

Entity relations:
- Has_qualifier("anovulation", "eugonadotrophic")
- AND("Infertile", "anovulation")
- OR("anovulation", "oligoovulation")